Clinical trial exclusion criterion:
Evidence of an active or suspected cancer or a history of malignancy where the risk of recurrence is >=20% within 2 years. Patients with a lesion suspicious of hepatic malignancy on a screening imaging study will only be eligible if the likelihood of carcinoma is <=10% following an appropriate evaluation.

Annotated entities:
- Temporal: "active"
- Mood: "suspected"
- Condition: "cancer"
- Condition: "malignancy"
- Measurement: "risk of recurrence"
- Value: ">=20% within 2 years"
- Condition: "lesion"
- Mood: "suspicious"
- Condition: "hepatic malignancy"
- Procedure: "screening imaging study"
- Measurement: "likelihood of carcinoma"
- Value: "<=10%"